6. Diagnosis of cognitive impairment from other causes (i.e., vitamine B12 and folic acid deficiency, thyroid disorders, metabolic diseases, head trauma, tumor or infections of the central nervous system, normal pressure hydrocephalus).

The above is a clinical trial exclusion criterion. Annotated with entity spans:
[Parsing_Error: 6.] Diagnosis of [Condition: cognitive impairment] from [Qualifier: other causes] (i.e., [Condition: vitamine B12] and [Condition: folic acid deficiency], [Condition: thyroid disorders], [Condition: metabolic diseases], [Condition: head trauma], [Condition: tumor] or [Condition: infections of the central nervous system], [Condition: normal pressure hydrocephalus]).